spine surgery in past

The above is a clinical trial exclusion criterion. Annotated with entity spans:
[Procedure: spine surgery] [Temporal: in past]